What percentage of human genes have no introns?

Intronless genes (IGs) constitute approximately 3% of the human genome. Intronless genes (IGs) fraction varies between 2.7 and 97.7% in eukaryotic genomes.